De las siguientes sugerencias a la familia sobre la alimentación del escolar para la prevención de la obesidad, señale cual NO es recomendable:
1. Evitar la goma de mascar (chicle), aunque sea sin azúcar, pues se acostumbra a tener la boca llena entre comidas.
2. Aumentar la ingesta de alimentos frescos, verduras y frutas.
3. Comer en familia, acompañado, al menos alguna comida principal de las 5 que se recomiendan al día.
4. Picar entre comidas para evitar tener mucha hambre en las comidas principales. Se recomiendan zumos enriquecidos.
5. Procurar no comer viendo la televisión, pues la distracción impide disfrutar de la comida y saber lo que se come.

Respuesta correcta: 4. Picar entre comidas para evitar tener mucha hambre en las comidas principales. Se recomiendan zumos enriquecidos.